Clinical trial exclusion criterion:
Ongoing serious bacterial infections at the time of screening.

Annotated entities:
- Condition: "bacterial infections"
- Qualifier: "serious"
- Temporal: "at the time of screening"
- Reference_point: "screening"